Which disease is treated with Tebentafusp?

Tebentafusp is used for treatment of Metastatic Uveal Melanoma.